Clinical trial inclusion criterion:
Patient has no other comorbidities that contraindicate the procedure

Entity relations:
- Has_qualifier("comorbidities that contraindicate the procedure", "other")
- Has_negation("comorbidities that contraindicate the procedure", "no")